Treatment with bupropion, varenicline, or nicotine replacement products in the month prior to study inclusion

The above is a clinical trial exclusion criterion. Annotated with entity spans:
[Procedure: Treatment] with [Drug: bupropion], [Drug: varenicline], or [Drug: nicotine replacement products] [Temporal: in the month prior to study inclusion]